病人 Y，男性 40 歲，血型 B 型 Rh 陽性，因罹患 B 型肝炎導致肝硬化，合併大量腹水、脾臟腫大、低白蛋白血症、凝血缺陷、肝腦病變；曾因此住院兩次接受保守治療，病況仍持續惡化，醫師建議接受活體肝臟移植治療。依照我國「人體器官移植條例」之規定，下列何人得依法捐贈肝臟給 Y？
A. Y 的妹婿 B，男性 40 歲，血型 B 型 Rh 陽性，經瞭解肝臟移植手術為其妻大哥之唯一生機，即表達強烈捐肝意願
B. Y17 歲的兒子 S，血型 B 型 Rh 陽性，經瞭解肝臟移植手術為其父之唯一生機，即表達強烈捐肝意願
C. Y 的同事兼好友 C，男性 35 歲，血型 B 型 Rh 陽性，經瞭解肝臟移植手術為其友之唯一生機，即表達強烈捐肝意願
D. Y 的同居女友 G（同時也是 S 的生母），血型 B 型 Rh 陽性，經瞭解肝臟移植手術為其男友之唯一生機，即表達強烈捐肝意願

正確答案：A. Y 的妹婿 B，男性 40 歲，血型 B 型 Rh 陽性，經瞭解肝臟移植手術為其妻大哥之唯一生機，即表達強烈捐肝意願